生長激素（growth hormone）具有促進脂肪和碳水化合物代謝的作用，主要係間接透過下列何種激素的作用來產生的？
A. 促甲狀腺激素（thyroid-stimulating hormone; TSH）
B. 促腎上腺皮質激素（adrenocorticotropic hormone; ACTH）
C. 促腎上腺皮質釋放激素（corticotropin-releasing hormone; CRH）
D. 第一型類胰島素成長因子（insulin-like growth factor; IGF-1）

正確答案：D. 第一型類胰島素成長因子（insulin-like growth factor; IGF-1）